Clinical trial exclusion criterion:
Children with any basal condition (trauma, infection, minor accidents, etc..) will be able to participate in the study provided they and their family are willing and do not meet the above-mentioned exclusion criteria.

Entity relations:
- Subsumes("basal condition", "trauma")
- OR("trauma", "infection", "minor accidents")